Clinical trial exclusion criterion:
Teeth with clinical symptoms of irriversible pulpitis or pulp necrosis or acute dental infection

Annotated entities:
- Condition: "irriversible pulpitis"
- Condition: "pulp necrosis"
- Condition: "acute dental infection"
- Qualifier: "Teeth"